Pregnancy or breastfeeding

The above is a clinical trial exclusion criterion. Annotated with entity spans:
[Condition: Pregnancy] or [Observation: breastfeeding]